Patients currently taking benzodiazepine drugs

The above is a clinical trial exclusion criterion. Annotated with entity spans:
Patients [Temporal: currently] taking [Procedure: benzodiazepine drugs]